Clinical trial exclusion criterion:
HIV or other chronic disease

Annotated entities:
- Condition: "HIV"
- Qualifier: "other"
- Condition: "chronic disease"